Clinical trial exclusion criterion:
Any vaccination 2 weeks prior start of the study

Annotated entities:
- Procedure: "vaccination"
- Temporal: "2 weeks prior start of the study"
- Reference_point: "start of the study"